inhalational induction scheduled

The above is a clinical trial inclusion criterion. Annotated with entity spans:
[Procedure: inhalational induction] [Mood: scheduled]